車禍造成尺骨中段骨折並傷及尺動脈（ulnar artery），下列何處是直接按壓止血的最適當位置？
A. 腋下（axilla）
B. 上臂中段（mid arm）
C. 肘窩（cubital fossa）
D. 鼻煙區（snuff box）

正確答案：C. 肘窩（cubital fossa）